Platelet count higher than 30x109/l at time of screening

The above is a clinical trial exclusion criterion. Annotated with entity spans:
[Measurement: Platelet count] [Value: higher than 30x109/l] [Temporal: at time of screening]